Patients who are making use of antidepressants, diuretics or anticoagulants;

The above is a clinical trial exclusion criterion. Annotated with entity spans:
Patients who are making use of [Drug: antidepressants], [Drug: diuretics] or [Drug: anticoagulants];